Clinical trial exclusion criterion:
1. Need for combined organ transplantation with an extra-renal organ and/or islet cell transplant.

Entity relations:
- Has_qualifier("combined organ transplantation", "extra-renal organ")
- OR("extra-renal organ", "islet cell transplant")